En las neuronas una vez que un potencial de acción ha comenzado, un segundo potencial de acción no puede ser disparado durante un breve espacio de tiempo, independientemente de la intensidad del estímulo aplicado. Este periodo de tiempo se conoce como:
1. Retraso sináptico.
2. Periodo despolarizante umbral.
3. Periodo refractario absoluto.
4. Periodo refractario relativo.
5. Sumación espacial.

Respuesta correcta: 3. Periodo refractario absoluto.